estimated glomerular filtration rate (eGFR) > 60 ml/min

The above is a clinical trial inclusion criterion. Annotated with entity spans:
[Measurement: estimated glomerular filtration rate (eGFR)] [Value: > 60 ml/min]